為了處理 SARS 疫情，防疫單位針對疑似病例及其所接觸個案，採取集中隔離管制措施，並稱被集中隔離管制並不代表會生病，這是因為該疑似病例的疾病定義具備下列何種特性？
A. 低偽陽性
B. 低偽陰性
C. 高敏感度
D. 高特異度

正確答案：C. 高敏感度